Clinical trial inclusion criterion:
onset of diabetes after age 30

Entity relations:
- Has_value("onset of diabetes", "after age 30")